Administration of long-acting immune-modifying drugs at any time during the study period

The above is a clinical trial exclusion criterion. Annotated with entity spans:
Administration of [Qualifier: long-acting] [Drug: immune-modifying drugs] [Temporal: at any time during the study period]